Clinical trial exclusion criterion:
Allergy to benzodiazepines

Annotated entities:
- Condition: "Allergy"
- Drug: "benzodiazepines"